Clinical trial exclusion criterion:
Endocrine disorders

Annotated entities:
- Condition: "Endocrine disorders"